關於幼兒持續性高胰島素低血糖症（persistent hyperinsulinemic hypoglycemia of infancy）的敘述，下列何者錯誤？
A. 其遺傳模式為X-性聯遺傳（X-linked inheritance）
B. KIR 6.2 channel的基因突變會造成此病
C. sulfonylurea receptor的基因突變會造成此病
D. 需及時治療以避免神經方面的後遺症

正確答案：A. 其遺傳模式為X-性聯遺傳（X-linked inheritance）